下列那一種DNA病毒具有不同的血清型，會造成上呼吸道、結膜以及腸胃道的感染？
A. 乳突瘤病毒（Papillomavirus）
B. 腺病毒（Adenovirus）
C. 痘病毒（Poxvirus）
D. B19細小病毒（Parvovirus B19）

正確答案：B. 腺病毒（Adenovirus）